Clinical trial inclusion criterion:
HBsAg-positive for more than 6 months and HBV DNA < 2000 IU/ml (Subgroup 1)or HBsAg-negative but anti-HBc positive with HBV DNA < 2000 IU/ml (Subgroup 2).

Annotated entities:
- Measurement: "HBsAg"
- Value: "positive"
- Temporal: "more than 6 months"
- Measurement: "HBV DNA"
- Value: "< 2000 IU/ml"
- Measurement: "HBsAg"
- Value: "negative"
- Measurement: "anti-HBc"
- Value: "positive"
- Measurement: "HBV DNA"
- Value: "< 2000 IU/ml"